一位 70 歲患者因罹患肺結核而使用抗結核藥物，下列何種抗結核藥物，不會引起肝炎副作用？
A. Isoniazid
B. Rifampin
C. Ethambutol
D. Pyrazinamide

正確答案：C. Ethambutol